Clinical trial exclusion criterion:
Current involvement in another comparable study.

Annotated entities:
- Competing_trial: "Current involvement in another comparable study."